Clinical trial inclusion criterion:
1. Patient age ≥ 12 years

Annotated entities:
- Parsing_Error: "1."
- Person: "age"
- Value: "≥ 12 years"